Clinical trial exclusion criterion:
History of unstable progressive neurologic disorder of unknown cause

Entity relations:
- Has_qualifier("progressive neurologic disorder", "unknown cause")
- Has_qualifier("progressive neurologic disorder", "unstable")
- Has_temporal("progressive neurologic disorder", "History")